Clinical trial inclusion criteria:
Corneal ulcer that is smear positive for either bacteria or filamentous fungus
Pinhole visual acuity worse than 20/70 in the affected eye
Not treated already with antimicrobial medications at presentation
Age over 18 years
Basic understanding of the study as determined by the physician
Commitment to return for follow up visits

Annotated entities:
- Condition: "Corneal ulcer"
- Measurement: "smear"
- Qualifier: "bacteria"
- Qualifier: "filamentous fungus"
- Value: "positive"
- Measurement: "Pinhole visual acuity"
- Value: "worse than 20/70"
- Drug: "antimicrobial medications"
- Person: "Age"
- Value: "over 18 years"
- Non-query-able: "Basic understanding of the study as determined by the physician"
- Post-eligibility: "Commitment to return for follow up visits"